下列有關國民所得與總體醫療費用的敘述，何者較為正確？
A. 一般而言，國民所得增加與長期的總體醫療費用增加並沒有直接的關係
B. 長期而言，國民所得增加的比率，會小於總體醫療費用增加的比率，亦即醫療服務是奢侈品
C. 長期而言，國民所得增加的比率，會大於總體醫療費用增加的比率，亦即醫療服務是必需品
D. 長期而言，國民所得增加的比率，會等於總體醫療費用增加的比率

正確答案：B. 長期而言，國民所得增加的比率，會小於總體醫療費用增加的比率，亦即醫療服務是奢侈品